Clinical trial inclusion criteria:
Elective open abdominal hysterectomy with midline incision, age > 18 years, American Society of Anesthesiologist classification score (ASA classification) 1-3.

Annotated entities:
- Qualifier: "Elective"
- Procedure: "open abdominal hysterectomy"
- Qualifier: "midline incision"
- Person: "age"
- Value: "> 18 years"
- Measurement: "American Society of Anesthesiologist classification score"
- Measurement: "ASA classification"
- Value: "1-3"